Drug allergies: Any adverse reaction including immediate or delayed hypersensitivity to any intranasal, inhaled, or systemic corticosteroid therapy. Known or suspected sensitivity to the constituents of the ELLIPTA Inhaler (i.e., lactose, FF).

The above is a clinical trial exclusion criterion. Annotated with entity spans:
[Condition: Drug allergies]: Any [Condition: adverse reaction] including [Condition: immediate] or [Condition: delayed hypersensitivity] to any [Drug: intranasal], [Drug: inhaled], or [Drug: systemic corticosteroid] therapy. Known or suspected [Condition: sensitivity] to the [Drug: constituents of the ELLIPTA Inhaler] (i.e., [Drug: lactose], [Drug: FF]).